2 target vulnerable lesions

The above is a clinical trial inclusion criterion. Annotated with entity spans:
[Multiplier: 2] [Condition: target vulnerable lesions]